Patients with symptomatic persistent atrial fibrillation of less than 1-year duration.

The above is a clinical trial inclusion criterion. Annotated with entity spans:
Patients with [Qualifier: symptomatic] [Qualifier: persistent] [Condition: atrial fibrillation] of [Temporal: less than 1-year] duration.